Clinical trial exclusion criterion:
Active infection requiring systemic treatment,

Annotated entities:
- Condition: "infection"
- Procedure: "systemic treatment"
- Qualifier: "requiring systemic treatment"